Clinical trial exclusion criterion:
Presence of other haemodynamically significant obstructive lesions of the LV outflow tract, including aortic and subaortic stenosis.

Entity relations:
- Has_qualifier("obstructive lesions", "LV outflow tract")
- Subsumes("haemodynamically significant", "aortic stenosis")
- OR("aortic stenosis", "subaortic stenosis")
- OR("haemodynamically significant", "obstructive lesions")